Clinical trial inclusion criterion:
ECOG PS of 0-2;

Entity relations:
- Has_value("ECOG PS", "0-2")